Clinical trial exclusion criterion:
Exposure to more than 4 investigational medicinal products within 12 months prior to the first dosing day.

Annotated entities:
- Multiplier: "more than 4"
- Drug: "investigational medicinal products"
- Temporal: "within 12 months prior to the first dosing day"
- Reference_point: "the first dosing day"